模式辨識受體（pattern recognition receptors, PRRs）是先天免疫系統用來識別病原相關分子模式（pathogenassociated molecular patterns, PAMPs）的抗原受體，在所有先天免疫細胞都會表現。有關模式辨識受體的敘述 何者錯誤？
A. 模式辨識受體中的類鐸受體（Toll-like receptors）是演化上古老而保守的病原辨識受體，即便在無脊椎動物也有表現
B. 類鐸受體（Toll-like receptors）中TLR3和TLR7分別辨識源自於病毒的雙股及單股RNA
C. 模式辨識受體中的類NOD受體（nod-like receptors）主要是辨識胞內的病原菌，如沙門氏菌（Salmonella）及李斯特菌（Listeria）的細胞壁成分
D. 模式辨識受體中的類RIG-I受體（RIG-I-like receptors）是辨識DNA病毒的DNA，而且免疫細胞的類RIG-I受體和DNA結合後的訊息傳遞結果會產生第一型干擾素

正確答案：D. 模式辨識受體中的類RIG-I受體（RIG-I-like receptors）是辨識DNA病毒的DNA，而且免疫細胞的類RIG-I受體和DNA結合後的訊息傳遞結果會產生第一型干擾素